腦下垂體泌乳激素瘤（prolactinoma）1.8公分併視野缺損，下列敘述何者最正確？
A. 藥物治療一定有效
B. 手術切除後不會再發
C. 術後須定期追蹤
D. 手術後遺症為diabetes mellitus

正確答案：C. 術後須定期追蹤